Clinical trial inclusion criterion:
Performance status of 0-1

Entity relations:
- Has_value("Performance status", "0-1")